Clinical trial inclusion criterion:
liver transplant

Annotated entities:
- Procedure: "liver transplant"